Clinical trial exclusion criterion:
medical history that contraindicates the use of epinephrine

Entity relations:
- AND("contraindicates", "epinephrine")
- Has_temporal("contraindicates", "medical history")